Clinical trial exclusion criteria:
no consent
known allergy to administered opioid
contraindications to epidural analgesia
coagulopathies including platelet count of less than 100,000
spine surgery in past

Annotated entities:
- Informed_consent: "no consent"
- Condition: "allergy"
- Drug: "opioid"
- Condition: "contraindications"
- Procedure: "epidural analgesia"
- Condition: "coagulopathies"
- Measurement: "platelet count"
- Value: "less than 100,000"
- Procedure: "spine surgery"
- Temporal: "in past"